痛經婦女的經血中，下列何者含量較多？
A. 前列腺素（prostaglandin）
B. 黃體素（progesterone）
C. 血管加壓素（vasopressin）
D. 動情激素（estrogen）

正確答案：A. 前列腺素（prostaglandin）